關於更年期的敘述，下列何者正確？
A. 更年期的情緒不穩定和憂鬱與雌激素降低無關
B. 更年期大約在 65 到 75 歲之間，平均為 70 歲
C. 抽菸、化學治療、骨盆腔放射線治療等，會讓更年期提前
D. 進入更年期的女性，子宮不規則出血是很常見的，不須進一步檢查

正確答案：C. 抽菸、化學治療、骨盆腔放射線治療等，會讓更年期提前